下列何種病毒不會造成呼吸道感染？
A. Hepatitis D virus
B. Influenza virus
C. Respiratory syncytial virus
D. Adenovirus

正確答案：A. Hepatitis D virus